What is the ubiquitin proteome?

The ubiquitin proteome is the entire set ubiquitinated proteins and of their respective ubiquitination sites.